Never receiving adequate treatment or stop receiving treatment for at least 8 weeks

The above is a clinical trial inclusion criterion. Annotated with entity spans:
[Negation: Never] receiving [Qualifier: adequate] [Procedure: treatment] or [Negation: stop] receiving [Procedure: treatment] [Temporal: for at least 8 weeks]